Clinical trial inclusion criterion:
4. The subject has manifested at least 1 of the following symptoms while standing or had a medical history of 1 of the following when not treated for orthostatic hypotension (OH): dizziness, lightheadedness, feeling faint, or feeling like they might black out.

Annotated entities:
- Multiplier: "at least 1"
- Condition: "dizziness"
- Condition: "lightheadedness"
- Condition: "feeling faint"
- Condition: "feeling like they might black out"
- Condition: "orthostatic hypotension (OH)"
- Procedure: "treated"
- Negation: "not"
- Multiplier: "1"